What is the life expectancy of professional athletes in respect to the general population?

Elite endurance (aerobic) athletes and mixed-sports (aerobic and anaerobic) athletes show higher longevity than the general population, but results  about power (anaerobic) athletes are inconsistent.